Clinical trial exclusion criterion:
5. Acute myocardial infarction, cardiac ischemia indicated by 6-minute walk test, hypertrophic cardiomyopathy, constrictive pericarditis, significant valve disease or congenital heart disease, severe pulmonary hypertension;

Annotated entities:
- Condition: "Acute myocardial infarction"
- Condition: "cardiac ischemia"
- Procedure: "6-minute walk test"
- Condition: "hypertrophic cardiomyopathy"
- Condition: "constrictive pericarditis"
- Condition: "valve disease"
- Qualifier: "significant"
- Condition: "congenital heart disease"
- Condition: "severe pulmonary hypertension"
- Qualifier: "severe"
- Qualifier: "congenital"